participant's age 18 years or older at the time of signing the informed consent form

The above is a clinical trial inclusion criterion. Annotated with entity spans:
participant's [Person: age] [Value: 18 years or older] [Temporal: at the time of signing the informed consent form]